Clinical trial inclusion criterion:
Availability of a signed patient information sheet (Informed Consent form) for participation in the clinical trial.

Annotated entities:
- Post-eligibility: "Availability of a signed patient information sheet (Informed Consent form) for participation in the clinical trial"